胎盤是內分泌器官，能合成不同的類固醇激素，但胎盤缺乏何種酶，在合成動情素或黃體素時，其前置物（precusors）必經由胎兒或母親提供？
A. P450 aromatase
B. 3-β-OH dehydrogenase
C. P450c 17（17-hydroxylation & 17～20 desmolase）
D. 21α-hydroxylase

正確答案：C. P450c 17（17-hydroxylation & 17～20 desmolase）